Current pregnancy or lactation.

The above is a clinical trial exclusion criterion. Annotated with entity spans:
[Temporal: Current] [Condition: pregnancy] or [Condition: lactation].